Clinical trial exclusion criterion:
contraceptive injection

Annotated entities:
- Device: "contraceptive injection"